Clinical trial exclusion criterion:
7. History of significant urogenital or uterine prolapse, undiagnosed vaginal bleeding, urethral obstruction

Annotated entities:
- Condition: "urogenital prolapse"
- Condition: "uterine prolapse"
- Condition: "vaginal bleeding"
- Qualifier: "undiagnosed"
- Condition: "urethral obstruction"
- Qualifier: "significant"
- Temporal: "History"
- Subjective_judgement: "significant"